List mutations that are implicated in the Gray Platelet Syndrome.

GFI1B and NBEAL2 mutations are implicated in the Gray Platelet Syndrome.